High bleeding risk; such as platelets <50,000 / mm3 during screening, Hb <8.5 g / dL, history of intracranial hemorrhage or subdural hematoma, major surgery, parenchymal organ biopsy or severe trauma within 30 days before inclusion, active gastrointestinal ulcer in the last 3 months;

The above is a clinical trial exclusion criterion. Annotated with entity spans:
[Qualifier: High] [Observation: bleeding risk]; such as [Measurement: platelets] [Value: <50,000 / mm3] during screening, [Measurement: Hb] [Value: <8.5 g / dL], history of [Condition: intracranial hemorrhage] or [Condition: subdural hematoma], [Procedure: major surgery,] [Procedure: parenchymal organ biopsy] or [Qualifier: severe] [Condition: trauma] [Temporal: within 30 days] before inclusion, [Qualifier: active] [Condition: gastrointestinal ulcer] in the [Temporal: last 3 months];